Nitroglycerin usage or nitrates and use of phosphodiesterase 5 (PDE5) inhibitors

The above is a clinical trial exclusion criterion. Annotated with entity spans:
[Drug: Nitroglycerin] usage or [Drug: nitrates] and use of [Drug: phosphodiesterase 5 (PDE5) inhibitors]